BMI more than 30

The above is a clinical trial exclusion criterion. Annotated with entity spans:
[Measurement: BMI] [Value: more than 30]